一位 30 歲的男性，主訴有下背痛合併左下肢坐骨神經痛，磁振造影（MRI）檢查顯示在第四、五腰椎左側椎孔外有椎間盤突出（extraforaminal disc herniation）。最有可能受到壓迫刺激的神經根是下列何者？
A. 左側第二腰椎神經根
B. 左側第三腰椎神經根
C. 左側第四腰椎神經根
D. 左側第五腰椎神經根

正確答案：C. 左側第四腰椎神經根